下列那一種利尿劑對腎因性尿崩症（nephrogenic diabetes insipidus）可減少其多尿及煩渴之症狀？
A. amiloride
B. torsemide
C. hydrochlorothiazide
D. brinzolamide

正確答案：C. hydrochlorothiazide